Clinical trial exclusion criterion:
19. Subjects must not donate blood while on study and for at least 90 days following the last MEDI4736 treatment.

Annotated entities:
- Parsing_Error: "19."
- Procedure: "donate blood"
- Negation: "not"
- Temporal: "while on study"
- Reference_point: "on study"
- Temporal: "for at least 90 days following the last MEDI4736 treatment"
- Reference_point: "the last MEDI4736 treatment"